Clinical trial exclusion criterion:
physical limitations that might be aggravated by moderate physical activity

Entity relations:
- Has_qualifier("aggravated by physical activity", "moderate")
- Has_qualifier("physical limitations", "aggravated by physical activity")